Clinical trial exclusion criterion:
Obesity (Body Mass Index > 30)

Entity relations:
- Has_value("Body Mass Index", "> 30")
- Subsumes("Obesity", "Body Mass Index")